Clinical trial inclusion criterion:
2. Screening tools: Medical Assessment, Medical History and Physical Examination. Medical assessments include: Vital Signs, EKG, oral HIV test, height/weight measurements, urinalysis and blood sample. Tests on the blood sample include CBC, complete metabolic profile, TSH, ESR, STS and HIV (if needed to confirm a positive salivary test for HIV). The following individual laboratory results will independently disqualify individuals: Cholesterol >250 mg/dl, Hemoglobin < 10.5 g/dl, WBC < 2400/microl, LFTs > 3Xnormal, HCG positive, Casual serum glucose > 200 mg/dl, Urine protein > 1+. The MAI will retain discretion to exclude at less extreme values, depending on the clinical presentation. (Serum glucose over 140 mg/dl will be followed up with a fasting serum glucose assessment. Those with fasting glucose below 100 mg/dl may be considered for the protocol. Others will be rejected and referred for work-up.) MAI will make the final judgment on any questionable lab results.

Entity relations:
- Has_value("salivary test for HIV", "positive")
- Has_value("Cholesterol", ">250 mg/dl")
- Has_value("Hemoglobin", "< 10.5 g/dl")
- Has_value("WBC", "< 2400/microl")
- Has_value("LFTs", "> 3Xnormal")
- Has_value("HCG", "positive")
- Has_value("serum glucose", "> 200 mg/dl")
- Has_value("Urine protein", "> 1+")
- Has_negation("Cholesterol", "disqualify")
- Has_value("Serum glucose", "over 140 mg/dl")
- AND("Serum glucose", "fasting serum glucose assessment")
- OR("Cholesterol", "serum glucose", "HCG", "LFTs", "WBC", "Hemoglobin", "Urine protein")